Clinical trial exclusion criterion:
Subjects under the age of 21.

Annotated entities:
- Value: "under the age of 21"
- Person: "age"